下列那種分子的配對組合（內皮細胞上的分子/白血球上的分子）會在發炎反應細胞遷移（cell migration）時發生？
A. MadCAM/α4β1
B. E-selectin/CD15s（sialyl-Lewis-X carbohydrate of CD15）
C. IL-8/CCR2
D. VCAM-1/LFA-1

正確答案：B. E-selectin/CD15s（sialyl-Lewis-X carbohydrate of CD15）